王小姐平日聲音正常，但常有喉嚨異物感，一個月前接受全身麻醉施行子宮肌瘤切除手術，近一星期喉嚨異物感加重，並有輕微喉嚨痛及聲音沙啞情形，王小姐自訴最近並無感冒症狀，她最可能罹患何種疾病？
A. 聲帶結節（vocal cord nodules）
B. 聲帶肉芽腫（vocal cord granulomas）
C. 聲帶麻痺（vocal cord paralysis）
D. 瘜肉性聲帶炎（polypoid corditis）

正確答案：B. 聲帶肉芽腫（vocal cord granulomas）